Clinical trial inclusion criterion:
the last vaccination intervals = 14 days

Entity relations:
- Has_value("last vaccination intervals", "= 14 days")